Why are insulators necessary in gene therapy vectors?

a) They inhibit oncogene activation upon vector integration and b) They maximize the probability of vector expression upon integration in heterochromatinic regions